Clinical trial exclusion criterion:
Fibro vascular proliferation lesions on the conjunctival and/or corneal surface (i.e.: pterygium)

Entity relations:
- Subsumes("conjunctival", "pterygium")
- Has_qualifier("Fibro vascular proliferation lesions", "conjunctival")
- OR("conjunctival", "corneal surface")